Which cytokine molecule activates SMADs?

SMADs are activated by Transforming growth factor beta (TGF-β)